Clinical trial exclusion criterion:
Severe daytime sleepiness (Epworth sleepiness scale >18)

Entity relations:
- Has_qualifier("daytime sleepiness", "Severe")
- Has_value("Epworth sleepiness scale", ">18")
- Subsumes("daytime sleepiness", "Epworth sleepiness scale")